有關休克（shock）之敘述，下列何者錯誤？
A. 休克的機轉肇因於組織血流灌注不足（inadequate tissue perfusion）
B. 持續性嚴重腹瀉會造成大量脫水，但不致於造成休克
C. 嚴重心肌梗塞會造成心因性休克
D. 心包膜積水如發生心包膜填塞（pericardial tamponade），亦會造成休克

正確答案：B. 持續性嚴重腹瀉會造成大量脫水，但不致於造成休克